Clinical trial exclusion criterion:
Satisfies any contraindications or restrictions to Dapsone therapy as listed in the product labels.

Entity relations:
- AND("contraindications", "Dapsone")